current antibiotic use.

The above is a clinical trial exclusion criterion. Annotated with entity spans:
[Temporal: current] [Drug: antibiotic use].